2. Interest in participating in a novel nutritional supplement program.

The above is a clinical trial inclusion criterion. Annotated with entity spans:
2. [Post-eligibility: Interest in participating in a novel nutritional supplement program.]